Clinical trial exclusion criterion:
With evidence of a local or systemic infection, including urinary tract infection

Entity relations:
- Subsumes("local infection", "urinary tract infection")
- OR("local infection", "systemic infection")